在施行初次全膝人工關節置換術時，則下列何組織在術中必須被切除？
A. 前十	韌帶（anterior cruciate ligament）
B. 髕骨肌腱（patellar tendon）
C. 內側副韌帶（medial collateral ligament）
D. 外側副韌帶（lateral collateral ligament）

正確答案：A. 前十	韌帶（anterior cruciate ligament）